Clinical trial inclusion criterion:
Have a normal ECG; must not have the following to be acceptable: pathologic Q wave abnormalities, significant ST-T wave changes, left ventricular hypertrophy, right bundle branch block, left bundle branch block. (sinus rhythm is between 55-100 beats per minute)

Annotated entities:
- Measurement: "ECG"
- Value: "normal"
- Negation: "not"
- Observation: "pathologic Q wave abnormalities"
- Observation: "ST-T wave changes"
- Condition: "left ventricular hypertrophy"
- Condition: "right bundle branch block"
- Condition: "left bundle branch block"